Clinical trial inclusion criterion:
ECOG performance status =2.

Annotated entities:
- Measurement: "ECOG performance status"
- Value: "=2"